下列何者是"鹼基去除修復（base excision repair）＂的主要化合物？
A. 糖基化酶（DNA-N-Glycosylase）、AP 內切酶（AP endonuclease）
B. Uvr B/C 內切酶、光解酶（Photolyase）
C. AP 內切酶、烷化鳥嘌呤-烷基轉移酶（O6-Alkylguanine Alkytransferase）
D. Ruv D 內切酶、Rec BCD 內切酶

正確答案：A. 糖基化酶（DNA-N-Glycosylase）、AP 內切酶（AP endonuclease）